Clinical trial exclusion criterion:
Subject has a current chemical/alcohol dependency or significant psychosocial disturbance.

Annotated entities:
- Condition: "alcohol dependency"
- Condition: "chemical dependency"
- Condition: "psychosocial disturbance"
- Qualifier: "significant"